下列何種心雜音（cardiac murmur）不會因吸氣而強度增加？
A. 主動脈瓣閉鎖不全（aortic regurgitation）
B. 肺動脈瓣閉鎖不全（pulmonic regurgitation）
C. 三尖瓣狹窄（tricuspid stenosis）
D. 三尖瓣閉鎖不全（tricuspid regurgitation）

正確答案：A. 主動脈瓣閉鎖不全（aortic regurgitation）